Clinical trial inclusion criterion:
subjects older than 35 years

Annotated entities:
- Person: "years"
- Value: "older than 35"